neurodevelopmental disorders (including Trisomy 21)

The above is a clinical trial exclusion criterion. Annotated with entity spans:
[Condition: neurodevelopmental disorders] (including [Condition: Trisomy 21])